Clinical trial exclusion criterion:
Concurrent administration of any other anti-tumor therapy

Entity relations:
- Has_temporal("anti-tumor therapy", "Concurrent")
- Has_qualifier("anti-tumor therapy", "any other")